Not willing to participate

The above is a clinical trial exclusion criterion. Annotated with entity spans:
[Informed_consent: Not willing to participate]